Clinical trial inclusion criterion:
women previously diagnosed with generalized vulvodynia

Annotated entities:
- Condition: "generalized vulvodynia"
- Person: "women"